Clinical trial exclusion criteria:
Uncontrolled hypertension (defined as average SBP = 160 mmHg [2 readings taken at time of screening]).
End stage renal disease (CrCl < 15 ml/min)
Valvular Heart Disease including those with prosthetic valve, mitral stenosis (moderate to severe) or valve repair.
Excess alcohol intake (males: = 28 units/week, females: = 21 units/week. One unit of alcohol = 8 oz beer, 1 oz hard liquor or 4 oz wine).
Intracranial bleed at any point.
History of "Major Bleeding" at any point (defined as overt bleeding at a critical site including intracranial, intraspinal, intraocular, pericardial, or retroperitoneal; or bleed requiring hospitalization).
Foreshortened life-expectancy or severe comorbidities precluding study follow-up period
Unable to read/understand English
Severe cognitive impairment (defined as score = 5 on the Short Portable Mental Status Questionnaire)

Annotated entities:
- Condition: "hypertension"
- Qualifier: "Uncontrolled"
- Measurement: "average SBP"
- Value: "= 160 mmHg"
- Multiplier: "2 readings"
- Temporal: "at time of screening"
- Reference_point: "screening"
- Condition: "End stage renal disease"
- Measurement: "CrCl"
- Value: "< 15 ml/min"
- Condition: "Valvular Heart Disease"
- Device: "prosthetic valve"
- Condition: "mitral stenosis"
- Qualifier: "moderate"
- Qualifier: "severe"
- Procedure: "valve repair"
- Measurement: "alcohol intake"
- Person: "males"
- Value: "= 28 units/week"
- Value: "Excess"
- Person: "females"
- Value: "= 21 units/week"
- Non-representable: "One unit of alcohol = 8 oz beer, 1 oz hard liquor or 4 oz wine"
- Condition: "Intracranial bleed"
- Temporal: "at any point"
- Condition: "Major Bleeding"
- Temporal: "at any point"
- Temporal: "History"
- Condition: "overt bleeding"
- Qualifier: "critical site"
- Qualifier: "intracranial"
- Qualifier: "intraspinal"
- Qualifier: "intraocular"
- Qualifier: "pericardial"
- Qualifier: "retroperitoneal"
- Condition: "bleed"
- Procedure: "hospitalization"
- Observation: "life-expectancy"
- Value: "Foreshortened"
- Condition: "severe comorbidities"
- Non-query-able: "Unable to read/understand English"
- Qualifier: "Severe"
- Condition: "cognitive impairment"
- Measurement: "Short Portable Mental Status Questionnaire"
- Value: "= 5"